Clinical trial exclusion criterion:
Sensitization (i.e. PRA >20%)

Annotated entities:
- Condition: "Sensitization"
- Measurement: "PRA"
- Value: ">20%"